Clinical trial inclusion criterion:
Critically ill patients (typically admitted to the intensive care unit)

Entity relations:
- Has_mood("admitted", "typically")
- AND("admitted", "intensive care unit")
- AND("Critically ill", "admitted")